Clinical trial inclusion criterion:
All patients with esophageal cancer who are deemed candidates for minimally invasive robot assisted Ivor Lewis esophagogastrectomy.

Entity relations:
- Has_qualifier("esophagogastrectomy", "Ivor Lewis")
- Has_qualifier("esophagogastrectomy", "robot assisted")
- Has_qualifier("esophagogastrectomy", "minimally invasive")
- AND("candidates", "esophagogastrectomy")